Clinical trial inclusion criterion:
2. Presence of P. knowlesi malaria, confirmed by positive blood smear with asexual forms of P. knowlesi.

Entity relations:
- Has_value("blood smear", "positive")
- Has_qualifier("positive", "with asexual forms of P. knowlesi")
- AND("P. knowlesi malaria", "blood smear")